Clinical trial exclusion criterion:
History of congesting heart failure with left ventricular ejection fraction <30% or exacerbation in the past 30 days.

Entity relations:
- Has_value("left ventricular ejection fraction", "<30%")
- Has_temporal("exacerbation", "in the past 30 days")
- AND("congesting heart failure", "left ventricular ejection fraction")
- OR("left ventricular ejection fraction", "exacerbation")